癌症惡病質（Cancer cachexia）引起的原因主要為下列何者？
A. 腫瘤吸收了大部份的養份
B. 大量細胞激素（Cytokines）的產生
C. 血液的流失
D. 電解質的失衡

正確答案：B. 大量細胞激素（Cytokines）的產生